下列有關腕隧道症候群（carpal tunnel syndrome）的描述，何者錯誤？
A. 由腕隧道經過的神經為橈神經（radial nerve）
B. Tinel's sign positive
C. 病人若出現魚際肌（thenar muscle）萎縮或無力代表嚴重的運動神經壓迫
D. 可透過神經傳導速度（nerve conduction velocity）檢查來確定診斷

正確答案：A. 由腕隧道經過的神經為橈神經（radial nerve）